大多數阿茲海默症的病人，在疾病早期受影響最多的認知功能為：
A. 情節性記憶（episodic memory）
B. 人臉的辨認（face recognition）
C. 穿衣服的能力（dressing）
D. 人格改變（personality change）

正確答案：A. 情節性記憶（episodic memory）